各種消化道平滑肌收縮模式中，那一種是大腸特有的平滑肌收縮？
A. Peristaltic wave
B. Segmentation contraction
C. Tonic contraction
D. Mass action contraction

正確答案：D. Mass action contraction